Digital Sympathectomy or botulinum toxin injection planned in the following month.

The above is a clinical trial exclusion criterion. Annotated with entity spans:
[Procedure: Digital Sympathectomy] or [Procedure: botulinum toxin injection] [Mood: planned] [Temporal: in the following month].